Subject demonstrating an IIEF-5 drug-free baseline score that is = 10 but = 16, and an IIEF-5 tadalafil-alone baseline score that is = 18

The above is a clinical trial inclusion criterion. Annotated with entity spans:
Subject demonstrating an [Measurement: IIEF-5 drug-free baseline score] that is [Value: = 10 but = 16], and an [Measurement: IIEF-5 tadalafil-alone baseline score] that is [Value: = 18]